下列關於腸病毒感染的敘述，何者錯誤？
A. 哺餵母乳可以減少腸病毒感染
B. 手足口症主要由克沙奇 A16（coxsackievirus A16）和腸病毒 71 型（enterovirus 71）感染所致
C. 腸病毒 71 型感染是造成腦幹腦炎等重症的主要原因之一
D. 腸病毒感染最好發於春季

正確答案：D. 腸病毒感染最好發於春季